Which deep learning framework has been developed for cancer molecular subtype classification?

DeepCC is a novel deep learning-based framework for cancer molecular subtype classification.